Clinical trial exclusion criterion:
a history of infection

Entity relations:
- Has_temporal("infection", "history")